Pregnant or childbearing potential women or breastfeeding women

The above is a clinical trial exclusion criterion. Annotated with entity spans:
[Condition: Pregnant] or [Condition: childbearing potential] [Person: women] or [Observation: breastfeeding] [Person: women]